有關常見無害心雜音（Innocent murmur）的敘述，下列何者錯誤？
A. 心雜音強度通常低於第三度
B. 坐姿比平躺時，雜音較明顯
C. 心雜音強度會隨	呼吸改變
D. 雜音常在收縮期，且為共振音或樂音（Vibratory or musical murmur）

正確答案：B. 坐姿比平躺時，雜音較明顯